王女士是市場菜販，有吸菸習慣（一天一包），常有胃酸逆流的情形，近幾個月來聲音變得低沉，但無呼吸困難也無喉嚨疼痛，有關於王女士之檢查結果，下列何者較不可能出現？
A. 可能併有甲狀腺機能低下症
B. 喉鏡檢查呈現雙側聲帶水腫
C. 喉鏡檢查呈現雙側聲帶麻痺
D. 喉頻閃鏡（videostroboscopy）檢查時，聲帶之黏膜波動幅度增加

正確答案：C. 喉鏡檢查呈現雙側聲帶麻痺